Clinical trial exclusion criterion:
Patient treated with corticosteroids within 2 weeks before study inclusion.

Annotated entities:
- Drug: "corticosteroids"
- Temporal: "within 2 weeks before study inclusion"
- Reference_point: "study inclusion"